Clinical trial exclusion criterion:
Pregnant woman is receiving any drug with antiviral activity or any form of drug therapy for hepatitis B virus

Entity relations:
- AND("drug therapy", "hepatitis B virus")
- OR("drug with antiviral activity", "drug therapy")